下列關於登革熱（dengue fever）的敘述，何者錯誤？
A. 登革病毒的主要傳播媒介-埃及斑蚊（Aedes aegypti）分布在住家附近，且在白天叮咬人類
B. 登革病毒分四個血清型，感染其中一型可對四種血清型病毒終身免疫
C. 若先前曾經感染某一血清型登革病毒，後來再感染另一種血清型登革病毒，則可能發生出血性登革熱或登革休克症候群
D. 登革熱的典型症狀包含發燒、頭痛、眼窩後痛、背痛、嚴重肌肉疼痛及皮疹

正確答案：B. 登革病毒分四個血清型，感染其中一型可對四種血清型病毒終身免疫